Unable to consent

The above is a clinical trial exclusion criterion. Annotated with entity spans:
[Post-eligibility: Unable to consent]